Clinical trial inclusion criterion:
HIV-1 infected males or females

Annotated entities:
- Condition: "HIV-1 infected"
- Person: "males"
- Person: "females"